陳同學 21 歲，星期六晚上與女友相約看星星，以右側上臂供女友長時間枕靠，第二天早上發現右手腕及手指下垂無法伸展，兩個月後才慢慢恢復。陳同學最可能的診斷為何？
A. 正中神經損傷
B. 橈神經損傷
C. 尺神經損傷
D. 肌皮神經損傷

正確答案：B. 橈神經損傷